El número de enlace del DNA:
1. Es el número de puentes de hidrógeno de un DNA de doble hebra.
2. Es el número de apareamientos óptimos en un DNA de doble hebra.
3. Es el número de enlaces fosfoéster en un DNA de cadena sencilla.
4. Es una propiedad topológica y define el grado de superenrollamiento de un DNA.
5. Es el número de giros en un DNA de doble hebra.

Respuesta correcta: 4. Es una propiedad topológica y define el grado de superenrollamiento de un DNA.